下列何者為GABAB受體的致效劑（agonist），主要作用於中樞神經系統，用於治療肌肉疼痛和痙攣？
A. dantrolene
B. baclofen
C. rocuronium
D. tizanidine

正確答案：B. baclofen